Which protein family is epiregulin a member of?

EREG (epiregulin), a member of the epidermal growth factor (EGF) family.